目前老年型聽損（age related hearing loss）在內耳的病理變化，主要是根據 Gacek 及 Schuknecht 在 年的人體顳骨解剖研究，此研究顯示內耳相關的聽力老化最主要是那種細胞的退化？
A. 內毛細胞（inner hair cells）
B. 螺旋神經節細胞（spiral ganglion cells）
C. 血管紋細胞（striae vascularis cells）
D. 外毛細胞（outer hair cells）

正確答案：C. 血管紋細胞（striae vascularis cells）